Insulin sensitizing treatment within 3 months prior to or during the eight week study period.

The above is a clinical trial exclusion criterion. Annotated with entity spans:
[Procedure: Insulin sensitizing treatment] [Temporal: within 3 months prior to] or [Temporal: during the eight week study period].